Estimated gestational age greater than 20 weeks

The above is a clinical trial inclusion criterion. Annotated with entity spans:
[Measurement: Estimated gestational age] [Value: greater than 20 weeks]